Clinical trial exclusion criterion:
Primary renal impairment, creatinine clearance < 45 ml/min if treated with metformin.

Entity relations:
- AND("Primary renal impairment", "metformin")
- AND("Primary renal impairment", "creatinine clearance")
- Has_value("creatinine clearance", "< 45 ml/min")